Clinical trial inclusion criterion:
Residing in the Manya Krobo or Yilo Krobo district

Annotated entities:
- Visit: "Manya Krobo district"
- Visit: "Yilo Krobo district"
- Observation: "Residing"